Presence of a skin lesion suspicious for malignancy, unless excised prior to Day 1.

The above is a clinical trial exclusion criterion. Annotated with entity spans:
Presence of a [Condition: skin lesion] [Qualifier: suspicious for malignancy], unless [Procedure: excised] [Temporal: prior to Day 1].